Which R package can infer protein-protein interactions via thermal proximity coaggregation (TPCA)?

Rtpca is an R package for differential thermal proximity coaggregation analysis. It is based on a model of thermal proximity (TFD) analysis performed by combining multiple layers of TSSs with TSSS (TSC) and TSSF (TSS-FANCA) data.